有關睪丸血液屏障（blood-testis barrier），下列敘述何項錯誤？
A. 此屏障將有絲分裂（mitosis）的細胞與減數分裂（meiosis）的細胞隔開
B. 此屏障將細精小管（seminiferous tubule）分為基底隔間（basal compartment）及腔室隔間（luminal compartment）
C. 可用一般光學顯微鏡觀察到此屏障
D. 功能上，此屏障可以保護精子生成細胞不被免疫系統攻擊

正確答案：C. 可用一般光學顯微鏡觀察到此屏障